Patients undergoing SSRF at Denver Health Medical Center

The above is a clinical trial inclusion criterion. Annotated with entity spans:
Patients undergoing [Procedure: SSRF] at [Visit: Denver Health Medical Center]